¿Cuál de los siguientes elementos es un factor de virulencia de Bacillus anthracis?
1. Endosporas.
2. Cápsulas.
3. Fímbrias.
4. Adhesinas de pared.

Respuesta correcta: 2. Cápsulas.